Active psychosis or psychotic disorder, severe depression (as determined per clinician prescriber judgment), severe psychiatric instability or severe situational life crisis (including evidence of being actively suicidal or homicidal).

The above is a clinical trial exclusion criterion. Annotated with entity spans:
[Qualifier: Active] [Condition: psychosis] or [Condition: psychotic disorder], [Condition: severe depression] (as determined per clinician prescriber judgment), [Qualifier: severe] [Condition: psychiatric instability] or [Qualifier: severe] [Condition: situational life crisis] (including evidence of being actively [Condition: suicidal] or [Condition: homicidal]).